adjuvant radiotherapy

The above is a clinical trial exclusion criterion. Annotated with entity spans:
[Procedure: adjuvant radiotherapy]